Patients with osteoarthritis of the hip secondary to degeneration, inflammatory arthritis, gouty arthritis, acetabular dysplasia or osteonecrosis of the femoral head, and undergoing primary unilateral minimally invasive THA

The above is a clinical trial inclusion criterion. Annotated with entity spans:
Patients with [Condition: osteoarthritis] of the [Qualifier: hip] [Qualifier: secondary to degeneration], [Condition: inflammatory arthritis], [Condition: gouty arthritis], [Condition: acetabular dysplasia] or [Condition: osteonecrosis] of the [Qualifier: femoral head], and [Temporal: undergoing] [Qualifier: primary] [Qualifier: unilateral] [Procedure: minimally invasive THA]